Clinical trial inclusion criterion:
Patients defined by subtype based on 2013 updated phenotypic criteria.

Annotated entities:
- Non-representable: "Patients defined by subtype based on 2013 updated phenotypic criteria."